La hipersensibilidad retardada (DTH) o de tipo IV se debe a una respuesta de:
1. Anticuerpos de clase IgE.
2. Linfocitos T “helper” 2 (Th2)
3. Linfocitos Th1 y linfocitos T CD8+.
4. Linfocitos B.

Respuesta correcta: 3. Linfocitos Th1 y linfocitos T CD8+.